牽涉性耳痛（Referred otalgia）常肇因於舌部，口腔底部，舌根部和咽部之病灶，與它無關聯的神經為：
A. 舌神經
B. 迷走神經
C. 舌咽神經
D. 舌下神經

正確答案：D. 舌下神經